Clinical trial exclusion criterion:
Known hypersensibility to coumadin or indoine derivatives or to any excipients (CI to oral AVK)

Entity relations:
- AND("hypersensibility", "coumadin")
- OR("coumadin", "indoine")